下列有關卵巢 dysgerminoma 的敘述，何者錯誤？
A. 最常見的惡性生殖細胞腫瘤（malignant germ cell tumor）
B. 好發於停經後婦女
C. 較其他惡性生殖細胞瘤更常見兩側性侵犯
D. 對放射治療（radiation therapy）非常敏感

正確答案：B. 好發於停經後婦女